Implanted Fineline-II-leads (BSCI), MRI conditional

The above is a clinical trial inclusion criterion. Annotated with entity spans:
[Device: Implanted Fineline-II-leads] ([Device: BSCI]), [Qualifier: MRI conditional]